¿Cuál de los siguientes síntomas NO se considera una manifestación de Trastorno obsesivo compulsivo en la infancia?:
1. Las compulsiones de comprobación.
2. La lentitud excesiva asociada a la necesidad de simetría.
3. Los pensamientos intrusivos obsesivos sin compulsiones.
4. Los rituales evolutivos que no causan interferencia.

Respuesta correcta: 4. Los rituales evolutivos que no causan interferencia.